下列各項神經疾病，何者的感覺系統最不會受到侵犯？
A. 糖尿病多發性神經病變（diabetic polyneuropathy）
B. 腕隧道症候群（carpal tunnel syndrome）
C. 運動神經元病變（motor neuron disease）
D. 腰神經根病變（lumbar root lesion）

正確答案：C. 運動神經元病變（motor neuron disease）